Clinical trial exclusion criteria:
hematology diseases
clotting factor deficiency

Annotated entities:
- Condition: "hematology diseases"
- Condition: "clotting factor deficiency"